Clinical trial exclusion criterion:
4. Presence of medical conditions that might interfere with participation, or where participation would be contraindicated

Annotated entities:
- Context_Error: "Presence of medical conditions that might interfere with participation, or where participation would be contraindicated"